3. Subject and/or guardian must be able to provide informed consent.

The above is a clinical trial inclusion criterion. Annotated with entity spans:
3. [Non-query-able: Subject and/or guardian must be able to provide informed consent.]